國人孕產婦死亡率約為多少？
A. 7/1,000
B. 7/10,000
C. 7/100,000
D. 7/1,000,000

正確答案：C. 7/100,000